Clinical trial exclusion criterion:
Patients with severe renal impairment (CLcr = 29 mL/min, or eGFR = 29 mL/min/1.73 m2), or moderate or severe hepatic impairment (Child-Pugh classes B or C).

Entity relations:
- Has_qualifier("renal impairment", "severe")
- Has_value("CLcr", "= 29 mL/min")
- Has_value("eGFR", "= 29 mL/min/1.73 m2")
- Subsumes("renal impairment", "CLcr")
- Has_qualifier("hepatic impairment", "moderate")
- Has_value("Child-Pugh classes", "B")
- Subsumes("hepatic impairment", "Child-Pugh classes")
- OR("CLcr", "eGFR")
- OR("moderate", "severe")
- OR("B", "C")
- OR("renal impairment", "hepatic impairment")